Clinical trial exclusion criterion:
21. Renal or hepatic insufficiency

Entity relations:
- OR("Renal insufficiency", "hepatic insufficiency")